Clinical trial exclusion criterion:
Previous known hypersensitivity to tetracyclines

Entity relations:
- AND("hypersensitivity", "tetracyclines")
- Has_temporal("hypersensitivity", "Previous")